Clinical trial exclusion criteria:
1. Congestive heart failure;
2. CABG or Percutaneous Coronary Intervention (PCI) procedure;
3. Planned need for major surgery (e.g. valve surgery or resection of aortic or left ventricular aneurysm, carotid end-arterectomy, abdominal aortic aneurysm surgery etc.);
4. Congenital heart disease;
5. Transmural myocardial infarction within the previous seven days and CK has not returned to normal;
6. Chest pain lasting longer than 30 minutes within 12 hours pre-procedure, if CK enzymes positive (≥ 2x the normal upper limit).
7. History of any cerebrovascular accident;
8. Left main stenosis of 50% or more;
9. Intention to treat more than 1 totally occluded major epicardial vessel;
10. Single vessel (single territory) disease.

Annotated entities:
- Condition: "Congestive heart failure"
- Procedure: "CABG"
- Procedure: "Percutaneous Coronary Intervention (PCI)"
- Procedure: "major surgery"
- Procedure: "valve surgery"
- Procedure: "carotid end-arterectomy"
- Procedure: "abdominal aortic aneurysm surgery"
- Procedure: "resection of left ventricular aneurysm"
- Procedure: "resection of aortic aneurysm"
- Procedure: "Congenital heart disease"
- Procedure: "Transmural myocardial infarction"
- Temporal: "within the previous seven days"
- Measurement: "CK"
- Negation: "has not returned"
- Value: "normal"
- Condition: "Chest pain"
- Qualifier: "lasting longer than 30 minutes"
- Temporal: "within 12 hours pre-procedure"
- Measurement: "CK enzymes"
- Value: "positive"
- Value: "≥ 2x the normal upper limit"
- Condition: "any cerebrovascular accident"
- Temporal: "History of"
- Condition: "Left main stenosis"
- Value: "50% or more"
- Mood: "Intention to"
- Multiplier: "more than 1"
- Qualifier: "totally occluded major epicardial vessel"
- Procedure: "treat"
- Condition: "Single vessel disease"
- Condition: "single territory disease"